Common Variable Immune Deficiency (CVID)

The above is a clinical trial exclusion criterion. Annotated with entity spans:
[Condition: Common Variable Immune Deficiency (CVID)]